Clinical trial inclusion criterion:
Females must have a urine or serum pregnancy test (Human Chorionic Gonadotropin) that is negative at Screening and Day 1

Annotated entities:
- Measurement: "serum pregnancy test"
- Measurement: "urine pregnancy test"
- Measurement: "Human Chorionic Gonadotropin"
- Value: "negative"
- Temporal: "at Screening"
- Temporal: "Day 1"